Clinical trial exclusion criterion:
participation in previous or concurrent HIV vaccine trials

Annotated entities:
- Competing_trial: "participation in previous or concurrent HIV vaccine trials"